Which particular intersex phenotype is related to steroid reductase?

Virilization of the external genitalia in the male fetus requires testosterone and dihydrotestosterone (DHT), which is formed from testosterone by the action of the enzyme, 5alpha-reductase type 2 (5alphaR-2). Numerous cases of male pseudohermaphroditism due to 5 alpha reductase-2 deficiency have been identified.